Born, raised and currently living at low altitude (<800m).

The above is a clinical trial inclusion criterion. Annotated with entity spans:
[Non-query-able: Born, raised and currently living at low altitude (<800m)].